Clinical trial exclusion criterion:
Subject has any history of previous transient ischemic attack or stroke.

Annotated entities:
- Condition: "transient ischemic attack"
- Condition: "stroke"